Clinical trial inclusion criterion:
Subjects must be female

Annotated entities:
- Person: "female"